Clinical trial inclusion criterion:
BV+ by Amsel criteria and Nugent score OR history of BV in the prior 6 months

Annotated entities:
- Measurement: "Amsel criteria"
- Measurement: "Nugent score"
- Value: "BV+"
- Condition: "BV"
- Condition: "BV"
- Temporal: "in the prior 6 months"